Clinical trial exclusion criterion:
Hemoglobin less than 7.0 gms even if receiving erythropoietin.

Annotated entities:
- Measurement: "Hemoglobin"
- Value: "less than 7.0 gms"
- Qualifier: "even if receiving erythropoietin"